Clinical trial exclusion criterion:
Preexisting neurological deficits or peripheral neuropathy in the distribution of the sciatic nerve

Entity relations:
- Has_qualifier("neurological deficits", "sciatic nerve")
- OR("neurological deficits", "peripheral neuropathy")